Clinical trial inclusion criterion:
index event is an acute complication (< 30 days) of PCI

Annotated entities:
- Condition: "complication of PCI"
- Value: "< 30 days"
- Qualifier: "acute"